當女性處於月經週期的濾泡期（follicular phase），hormone X的增加會負回饋抑制FSH的分泌；持續高濃度的 hormone Y可誘發LH surge；hormone Z促使primary oocyte轉變成secondary oocyte。下列敘述何者正確？
A. Hormone X即是hormone Y
B. Hormone Y即是hormone Z
C. Hormone X即是hormone Z
D. Hormone X是inhibin-A

正確答案：A. Hormone X即是hormone Y